肺泡壁之發炎反應，多見於那一種疾病？
A. 病毒感染
B. 細菌感染
C. 黴菌感染
D. 支氣管性肺炎

正確答案：A. 病毒感染